Clinical trial inclusion criterion:
Patients' tumor express Melan-A/MART-1 antigen.

Annotated entities:
- Observation: "MART-1 antigen"
- Observation: "Melan-A antigen"